Clinical trial inclusion criterion:
COPD: dyspnea: progressive (worsens over time), increases with exertion, persistent; chronic cough (may appear sporadically and may be unproductive); chronic expectoration; the impact of risk factors in the medical history (Smoking, occupational dust pollutants and chemicals); widespread wheeze on auscultation of the chest and/or distant wheezing in the chest; family history of COPD; spirometric data confirming the presence of fixed bronchial obstruction.

Entity relations:
- Subsumes("progressive", "worsens over time")
- Has_qualifier("wheeze on auscultation of the chest", "widespread")
- Has_context("COPD", "family history")
- AND("spirometric", "fixed bronchial obstruction")
- Subsumes("risk factors", "Smoking")
- Has_qualifier("dyspnea", "progressive")
- Subsumes("COPD", "dyspnea")
- Has_qualifier("dyspnea", "increases with exertion")
- Has_qualifier("dyspnea", "persistent")
- OR("Smoking", "occupational dust pollutants and chemicals")
- OR("dyspnea", "COPD", "wheeze on auscultation of the chest", "distant wheezing in the chest", "risk factors", "chronic expectoration", "chronic cough", "spirometric")